5. Hemoglobin < 10 g/dL

The above is a clinical trial exclusion criterion. Annotated with entity spans:
[Parsing_Error: 5.] [Measurement: Hemoglobin] [Value: < 10 g/dL]